Clinical trial inclusion criterion:
- Patient with IVF cycle and therefore having frozen-thawed embryos

Annotated entities:
- Procedure: "IVF cycle"
- Device: "frozen-thawed embryos"